Clinical trial inclusion criterion:
Not treated already with antimicrobial medications at presentation

Annotated entities:
- Drug: "antimicrobial medications"